Clinical trial exclusion criterion:
Poor ovarian response (POR) according to the European Society of Human Reproduction and Embryology (ESHRE) Criteria

Entity relations:
- Has_qualifier("Poor ovarian response (POR)", "European Society of Human Reproduction and Embryology (ESHRE) Criteria")